Clinical trial inclusion criteria:
Informed consent of parent(s) or legal guardian; informed consent or assent of subject as applicable.
Male or female children between the ages of 10 and 35 years with congenital heart disease that has been palliated with a Fontan circulation.
Ability of perform a maximal exercise test as defined by a respiratory exchange ratio (RER) greater than 1.0 at the time of maximal exercise

Annotated entities:
- Observation: "Informed consent of parent"
- Observation: "Informed consent of legal guardian"
- Observation: "informed consent of subject"
- Observation: "informed assent of subject"
- Person: "Male"
- Person: "female"
- Person: "children"
- Value: "between 10 and 35 years"
- Person: "ages"
- Condition: "congenital heart disease"
- Procedure: "Fontan circulation"
- Observation: "Ability of perform"
- Procedure: "maximal exercise test"
- Measurement: "respiratory exchange ratio (RER)"
- Value: "greater than 1.0"
- Qualifier: "at the time of maximal exercise"